Clinical trial exclusion criterion:
the presence of concurrent infection or inflammation

Annotated entities:
- Temporal: "concurrent"
- Condition: "infection"
- Condition: "inflammation"